Clinical trial exclusion criterion:
Contraindication to corticosteroid agents

Annotated entities:
- Condition: "Contraindication"
- Drug: "corticosteroid"